Coronary artery disease - stent

The above is a clinical trial exclusion criterion. Annotated with entity spans:
[Condition: Coronary artery disease] - [Device: stent]